Clinical trial exclusion criterion:
Impending or frank perforation at recruitment

Annotated entities:
- Condition: "perforation"